Patient has known hypersensitivity to any of the components of the formulations used in the study.

The above is a clinical trial exclusion criterion. Annotated with entity spans:
Patient has known [Condition: hypersensitivity] to any of the [Qualifier: components of the formulations] used in the study.